酵素反應在受質濃度極低時，所測得的初始反應速率會與受質濃度成正比，此反應速率常數應為下列何者？
A. k cat
B. k cat×Km
C. V max/Km
D. 1/Km

正確答案：C. V max/Km